Approximately how many recombination hotspots have been found in the yeast genome?

In the fission yeast genome DSBs are located within 194 prominent peaks separated on average by 65-kbp intervals of DNA that are largely free of DSBs.